思覺失調症（schizophrenia）的病人長期追蹤約有多少比率會自殺死亡？
A. 1～3%
B. 10～13%
C. 25～30%
D. 40～50%

正確答案：B. 10～13%